El término que engloba los cambios del endometrio durante el embarazo es:
1. Eclosión.
2. Aposición.
3. Adhesión.
4. Invasión.
5. Decidualización.

Respuesta correcta: 5. Decidualización.